Delirium at screening or baseline

The above is a clinical trial exclusion criterion. Annotated with entity spans:
[Condition: Delirium] [Temporal: at screening] or baseline